Clinical trial inclusion criterion:
Patient should be negative for HIV and B and C hepatitis.

Annotated entities:
- Measurement: "HIV"
- Value: "negative"
- Measurement: "C hepatitis"
- Measurement: "B hepatitis"